下列何者不是精神分裂症的負性症狀（negative symptoms）？
A. 臉部表情淡漠平板（affect blunting）
B. 語言貧乏（alogia）
C. 意志力缺乏（avolition）
D. 妄想（delusion）

正確答案：D. 妄想（delusion）